Clinical trial inclusion criterion:
Baseline LIC >7 mg/g dw (measured by MRI);

Annotated entities:
- Measurement: "Baseline LIC"
- Value: ">7 mg/g"
- Procedure: "MRI"